Clinical trial exclusion criterion:
Contraindication to or planned discontinuation of dual antiplatelet therapy within 1 year

Annotated entities:
- Condition: "Contraindication"
- Mood: "planned discontinuation"
- Procedure: "dual antiplatelet therapy"
- Temporal: "within 1 year"